Clinical trial exclusion criterion:
Medical conditions that require consistent use of medication or compromise sleep;

Annotated entities:
- Non-query-able: "Medical conditions that require consistent use of medication or compromise sleep"